Un paciente en tratamiento quimioterápico por leucemia ingresa por una neumonía para la que se ha prescrito tratamiento con cefepime. En una Rx/TAC tórax se observa un infiltrado con el signo del halo y menisco semilunar. La lesión es periférica y se indica una punción transtorácica para toma de muestras. Hasta tener los resultados histológicos y microbiológicos definitivos, ¿qué antimicrobiano añadiría al tratamiento?
1. Ganciclovir.
2. Caspofungina.
3. Fluconazol.
4. Piperacilina-tazobactam.
5. Voriconazol.

Respuesta correcta: 5. Voriconazol.